Clinical trial exclusion criterion:
bupropion

Annotated entities:
- Drug: "bupropion"